Clinical trial exclusion criteria:
contra-indications for regular dental treatment
medical history that contraindicates the use of epinephrine
participant taken an opioid or an opioid like analgesic within 24 hours
pregnant

Annotated entities:
- Condition: "contra-indications"
- Procedure: "regular dental treatment"
- Temporal: "medical history"
- Condition: "contraindicates"
- Drug: "epinephrine"
- Drug: "opioid"
- Drug: "opioid like analgesic"
- Temporal: "within 24 hours"
- Condition: "pregnant"